Clinical trial exclusion criterion:
Patients with any neoplasm except localized skin cancer and who is receiving adequate treatment.

Annotated entities:
- Condition: "neoplasm"
- Negation: "except"
- Condition: "localized skin cancer"